4. Claustrophobia;

The above is a clinical trial exclusion criterion. Annotated with entity spans:
4. [Condition: Claustrophobia];